Clinical trial exclusion criterion:
Acute critical limb ischemia

Annotated entities:
- Temporal: "Acute"
- Qualifier: "critical"
- Condition: "limb ischemia"